Clinical trial exclusion criterion:
Medication which affect glycemic control

Annotated entities:
- Drug: "Medication"
- Observation: "affect glycemic control"